Known intolerance to one of the two drugs.

The above is a clinical trial exclusion criterion. Annotated with entity spans:
Known [Condition: intolerance] to [Multiplier: one of the two] [Drug: drugs].